Tumors

The above is a clinical trial inclusion criterion. Annotated with entity spans:
[Condition: Tumors]